56 歲女性因三週前出現胸痛而診斷急性心肌梗塞，接受了血栓溶解劑治療後出院。最近二天因為覺得很喘經由門診住院。病人表示她很規則地服用醫師開立的藥物，包含 atorvastatin，lisinopril， metoprolol，aspirin。身體診察血壓 100/45 毫米汞柱，心跳每分鐘 46 次，雙側肺部有囉音（bilateral crackles），頸靜脈怒張，雙側下肢水腫，沒有出現新的心雜音或奔馬音（gallop）。心電圖有竇性心搏過緩，呈現近期的心肌梗塞，但沒有出現新的變化。下列處置何者正確？
A. 進行緊急置放心律調節器
B. 測量游離甲狀腺素 T4（free T4）
C. 使用強心藥 dobutamine
D. 使用利尿劑，同時減量或停用 metoprolol

正確答案：D. 使用利尿劑，同時減量或停用 metoprolol